List proteins of lipids droplets

perilipins
adipose differentiation-related protein
lipid storage droplet protein 5 
tail-interacting protein of 47 kilodaltons 
S3-12